Clinical trial exclusion criterion:
History of significant head trauma, seizure disorder, or mental retardation

Annotated entities:
- Condition: "head trauma"
- Condition: "seizure disorder"
- Condition: "mental retardation"
- Temporal: "History"